= 2 mm ST-elevation in 2 contiguous inferior leads (II, III, aVF) for a minimum combined total of = 4 mm ST-elevation

The above is a clinical trial inclusion criterion. Annotated with entity spans:
[Non-query-able: = 2 mm ST-elevation in 2 contiguous inferior leads (II, III, aVF) for a minimum combined total of = 4 mm ST-elevation]